Clinical trial exclusion criterion:
Need for emergency surgery for any reason.

Entity relations:
- Has_mood("emergency surgery", "Need for")